¿Cómo se denomina el esqueleto heterocíclico aromático de seis miembros con cuatro átomos de carbono y dos nitrógenos, estos últimos en posiciones 1 y 3:
1. Pirano.
2. Pirazol.
3. Piridina.
4. Pirimidina.

Respuesta correcta: 4. Pirimidina.